Clinical trial exclusion criterion:
Other severe concurrent illness (e.g. active infection, malignancy).

Annotated entities:
- Condition: "active infection"
- Condition: "malignancy"
- Condition: "illness"
- Qualifier: "concurrent"
- Qualifier: "severe"